正常時，下列何種 immunoglobulin（Ig）在血中濃度最高？何種最低？
A. IgM 最高，IgA 最低
B. IgA 最高，IgG 最低
C. IgE 最高，IgM 最低
D. IgG 最高，IgE 最低

正確答案：D. IgG 最高，IgE 最低